Clinical trial inclusion criterion:
3. Be in good health.

Annotated entities:
- Parsing_Error: "3."
- Condition: "good health"
- Undefined_semantics: "good health"
- Subjective_judgement: "good health"